慢性腎衰竭引起次發性副甲狀腺機能亢進（secondary hyperparathyroidism）有那些特徵？
A. 血鈣升高，血磷降低，因而副甲狀腺素（PTH）降低
B. 血磷升高，血鈣升高，因而 PTH 升高
C. 血鈣降低，血磷升高，因而 PTH 降低
D. 血磷升高，血鈣降低，因而 PTH 升高

正確答案：D. 血磷升高，血鈣降低，因而 PTH 升高